克氏循環（TCA cycle）中那種酵素的受質為一個四碳化合物？
A. 異檸檬酸脫氫酶（isocitrate dehydrogenase）
B. 烏頭酸酶（aconitase）
C. 檸檬酸合成酶（citrate synthase）
D. 乳酸脫氫酶（lactate dehydrogenase）

正確答案：C. 檸檬酸合成酶（citrate synthase）